On anticoagulant therapy

The above is a clinical trial exclusion criterion. Annotated with entity spans:
On [Procedure: anticoagulant therapy]